Clinical trial inclusion criterion:
Previous liver transplantation(more than 6 month).

Entity relations:
- Has_temporal("liver transplantation", "Previous")
- Subsumes("Previous", "more than 6 month")